Fasting cholesterol > 1.6 upper limits of normal.

The above is a clinical trial exclusion criterion. Annotated with entity spans:
[Measurement: Fasting cholesterol] [Value: > 1.6 upper limits of normal].